¿Qué medida define la frecuencia de padecer cáncer de pulmón entre las personas que fuman 20 cigarros al día respecto a las que no fuman?:
1. Incidencia acumulada.
2. Densidad de incidencia.
3. Riesgo relativo.
4. Riesgo atribuible.
5. Fracción etiológica de riesgo.

Respuesta correcta: 3. Riesgo relativo.